Clinical trial exclusion criteria:
Patient refusal for supraclavicular block
Inability to give informed consent
Allergy to local anesthetics
Hemidiaphragmatic dysfunction, suspected or known PNP
Neuromuscular disease
Obstructive or restrictive pulmonary disease
Medical or anatomic contraindication to supraclavicular blockade as judged by clinician
Pregnancy

Annotated entities:
- Observation: "Patient refusal"
- Procedure: "supraclavicular block"
- Observation: "Inability to give informed consent"
- Condition: "Allergy"
- Drug: "local anesthetics"
- Condition: "Hemidiaphragmatic dysfunction"
- Condition: "PNP"
- Qualifier: "known"
- Qualifier: "suspected"
- Condition: "Neuromuscular disease"
- Condition: "restrictive pulmonary disease"
- Condition: "Obstructive pulmonary disease"
- Qualifier: "anatomic"
- Qualifier: "Medical"
- Condition: "contraindication"
- Procedure: "supraclavicular blockade"
- Non-representable: "as judged by clinician"
- Condition: "Pregnancy"